Una de las enzimas que se mencionan a continuación no interviene en el metabolismo del glucógeno:
1. Glucógeno sintasa.
2. Glucógeno fosforilasa.
3. Glucosa-6-fosfato deshidrogenasa.
4. Fosfoglucomutasa.
5. UDP-glucosa pirofosforilasa.

Respuesta correcta: 3. Glucosa-6-fosfato deshidrogenasa.